confirmed diagnosis of H. pylori infection by at least one of the following methods: 13C-urea breath test, histology, rapid urease test or bacterial culture

The above is a clinical trial inclusion criterion. Annotated with entity spans:
confirmed diagnosis of [Condition: H. pylori infection] by at least one of the following methods: [Measurement: 13C-urea breath test], [Measurement: histology], [Measurement: rapid urease test] or [Measurement: bacterial culture]